6 歲小孩 5 天來逐漸出現走路困難，手腳末端有麻木感，理學檢查發現顱神經正常，四肢肌力約為三級（滿分五級），肌腱反射均降低。最近並無打過預防針，但 1 週前曾有輕微感冒症狀，並無服藥。住院後脊髓液分析細胞數為 0，蛋白質 90 mg/dL，血中肌肉酵素檢查為正常。最可能的診斷為：
A. 腦炎
B. 腦瘤
C. Guillain-Barré 症候群
D. 多發性肌炎

正確答案：C. Guillain-Barré 症候群